2. Patient with breast cancer, histologically proven, metastatic or locally advanced

The above is a clinical trial inclusion criterion. Annotated with entity spans:
[Parsing_Error: 2.] Patient with [Condition: breast cancer], [Procedure: histologically] [Value: proven], [Qualifier: metastatic] or [Qualifier: locally advanced]